關於韋爾病（Weil disease）的敘述，下列何者錯誤？
A. 其致病菌屬螺旋體（spirochete）
B. 包括黃疸、腎衰竭、廣泛血管炎、心肌炎等臨床症狀
C. 多數感染與從事水中活動或接觸動物有關
D. 常由患者糞便中分離到致病菌

正確答案：D. 常由患者糞便中分離到致病菌